下列有關冰凍肩（frozen shoulder）之復健治療，何者敘述最為正確？
A. 物理治療以熱療和關節活動治療為主
B. 需在麻醉下做關節活動治療
C. 復健治療需靠醫院設備器材才可實施
D. 復健治療可達到百分之百治癒的效果，不會再發

正確答案：A. 物理治療以熱療和關節活動治療為主